一位 28 歲男性這兩個月來一直覺得胸悶，照了一張 X 光，發現縱膈腔有一腫塊，身體檢查（physical examination）顯示左睪丸輕微腫大，其他無特殊發現。血中 α-fetoprotein 1050 ng/mL（正常＜20）， β-HCG 3562 mU/mL（正常＜5），LDH 357 U/L（正常＜271），這位病人最可能的診斷為何？
A. seminomatous germ cell tumor
B. nonseminomatous germ cell tumor
C. non-small cell lung cancer
D. thymoma

正確答案：B. nonseminomatous germ cell tumor